Clinical trial inclusion criterion:
Absolute neutrophil count ≥ 1,000/mcL

Annotated entities:
- Measurement: "Absolute neutrophil count"
- Value: "≥ 1,000/mcL"